Bone marrow disease

The above is a clinical trial exclusion criterion. Annotated with entity spans:
[Condition: Bone marrow disease]